Any condition that may interfere with protocol compliance including current heavy smoking (>20 cigarettes per day or >20 pack-years with active smoking during the last 10 years), regular use of alcohol.

The above is a clinical trial exclusion criterion. Annotated with entity spans:
Any condition that may interfere with protocol compliance including current [Condition: heavy smoking] ([Value: >20] [Measurement: cigarettes per day] or [Value: >20] [Measurement: pack-years] with [Condition: active smoking] [Temporal: during the last 10 years]), [Condition: regular use of alcohol].